有關 von Willebrand factor 之敘述，下列何者錯誤？
A. 主要由血管平滑肌細胞製造
B. 血管壁受損時，可和血小板結合
C. 可直接活化血小板
D. 可調控凝血第八因子（Factor VIII）

正確答案：A. 主要由血管平滑肌細胞製造